La reacción de fenol y acetona en presencia de ácido de Lewis produce un material llamado:
1. Bisfenol A.
2. Dacrón.
3. Bisfenol F.
4. Poliestireno.

Respuesta correcta: 1. Bisfenol A.